某旅行社舉辦出國 5 日遊，回國後，有 3 名參加的孩童先後因出血性腹瀉至醫院就醫，其中 1 名 4 歲兒童還併發溶血性尿毒症候群（hemolytic uremic syndrome）。下列那種細菌最有可能是導致此事件的致病原？
A. 大腸桿菌（Escherichia coli）
B. 綠膿桿菌（Pseudomonas aeruginosa）
C. 副溶血弧菌（Vibrio parahaemolyticus）
D. 胃幽門桿菌（Helicobacter pylori）

正確答案：A. 大腸桿菌（Escherichia coli）